Clinical trial exclusion criterion:
Subject has evidence of congestive heart failure (NYHA class II, III or IV) in sinus rhythm.

Entity relations:
- Has_value("NYHA class", "II")
- AND("congestive heart failure", "NYHA class")
- OR("II", "III", "IV")